Prior allergic reaction to any type of local anesthetic

The above is a clinical trial exclusion criterion. Annotated with entity spans:
Prior [Condition: allergic reaction] to any type of [Drug: local anesthetic]